Clinical trial inclusion criterion:
Meibomian Gland Dysfunction

Annotated entities:
- Condition: "Meibomian Gland Dysfunction"